表皮樣囊腫（epidermoid tumor）腦瘤會有下列何種特質？
A. 細菌性腦膜炎（bacterial meningitis）
B. 伴有先天異常（associated congenital malformations）
C. 對放射性治療有效（responsive to radiation therapy）
D. 無菌性腦膜炎（aseptic meningitis）

正確答案：D. 無菌性腦膜炎（aseptic meningitis）